therapy with aspirin and insulin;

The above is a clinical trial inclusion criterion. Annotated with entity spans:
therapy with [Drug: aspirin] and [Drug: insulin];